lower motor neuron 損傷後，其所支配之骨骼肌最可能發生何種症狀？
A. 伸張反射（stretch reflex）消失
B. 縮回反射（withdrawal reflex）增強
C. 肌肉張力（muscle tone）增加
D. 痙攣性麻痺（spastic paralysis）

正確答案：A. 伸張反射（stretch reflex）消失